Clinical trial inclusion criterion:
Primary kidney transplant recipients, adults

Entity relations:
- Has_qualifier("kidney transplant", "Primary")